Clinical trial exclusion criterion:
Systemic treatment, within 14 days before the first dose of ixazomib, with strong cytochrome P450 3A (CYP3A) inducers (rifampin, rifapentine, rifabutin, carbamazepine, phenytoin, phenobarbital), or use of Ginkgo biloba or St. John's wort.

Entity relations:
- Has_index("within 14 days before the first dose of ixazomib", "the first dose of ixazomib")
- multi("the first dose of ixazomib", "ixazomib")
- Has_temporal("Systemic treatment", "within 14 days before the first dose of ixazomib")
- Subsumes("strong cytochrome P450 3A (CYP3A) inducers", "rifampin")
- AND("Systemic treatment", "strong cytochrome P450 3A (CYP3A) inducers")
- OR("rifampin", "rifapentine", "rifabutin", "carbamazepine", "phenytoin", "phenobarbital")
- OR("strong cytochrome P450 3A (CYP3A) inducers", "St. John's wort", "Ginkgo biloba")